¿Cuál de las enzimas contiene manganeso?
1. Glutatión S-transferasa.
2. Glutatión reductasa.
3. Glutatión peroxidada.
4. Superóxido dismutasa.
5. Catalasa.

Respuesta correcta: 4. Superóxido dismutasa.